Adult patients up to age 75 years, undergoing elective, ambulatory, arthroscopic rotator cuff repair.

The above is a clinical trial inclusion criterion. Annotated with entity spans:
[Person: Adult] patients [Value: up to] [Person: age] 75 years, undergoing [Qualifier: elective], [Visit: ambulatory], [Procedure: arthroscopic rotator cuff repair].